¿Qué técnica genética podría utilizar para diagnosticar un síndrome de Miller-Diecker?
1. Citogenética convencional.
2. Hibridación in situ con fluorescencia (FISH) con sonda centromérica.
3. Hibridación in situ con fluorescencia (FISH) con sonda telomérica.
4. Hibridación in situ con fluorescencia (FISH) con sonda locus-específica.

Respuesta correcta: 4. Hibridación in situ con fluorescencia (FISH) con sonda locus-específica.